5 天大男嬰，被發現有呼吸窘迫、發紺、及心雜音。呼吸次數每分鐘 74 次合併厲害胸凹現象，肝臟於右肋骨下 5 公分摸得到，其右手血壓為 66/40 mmHg，左手及下肢血壓約為 44/20 mmHg。同時合併低血鈣。下列何者為不適當的處理？
A. 給予氣管插管（intubation）維持呼吸，並給予氧氣
B. 給予靜脈注射 dopamine、dobutamine
C. 給予靜脈注射 indomethacin
D. 抽血檢查是否合併染色體 22 q11 缺失症

正確答案：C. 給予靜脈注射 indomethacin